Clinical trial exclusion criterion:
patients with ectopic pregnancy;

Annotated entities:
- Condition: "ectopic pregnancy"